Clinical trial inclusion criterion:
4. hypertension (systolic blood pressure ≥ 140 or diastolic blood pressure ≥90 mmHg or treatment with antihypertensive drugs).

Annotated entities:
- Condition: "hypertension"
- Measurement: "systolic blood pressure"
- Value: "≥ 140"
- Measurement: "diastolic blood pressure"
- Value: "≥90 mmHg"
- Procedure: "treatment"
- Drug: "antihypertensive drugs"